下列何種病毒，與精神分裂症（schizophrenia）有關？
A. 西尼羅腦炎病毒（West Nile encephalitis virus）
B. 玻納病病毒（Borna disease virus）
C. 拉克里斯病毒（La Crosse virus）
D. 辛諾柏病毒（Sin Nombre virus）

正確答案：B. 玻納病病毒（Borna disease virus）